下列何種藥物不適用於vancomycin-resistant Enterococcus faecium之感染治療？
A. linezolid
B. tigecycline
C. quinupristin-dalfopristin
D. teicoplanin

正確答案：D. teicoplanin